Clinical trial inclusion criterion:
Informed consent of parent(s) or legal guardian; informed consent or assent of subject as applicable.

Entity relations:
- OR("Informed consent of parent", "Informed consent of legal guardian", "informed assent of subject", "informed consent of subject")